En las medidas quimioluminiscentes el analito que se quiere determinar tiene que pasar previamente al estado excitado mediante:
1. Absorción de radiación electromagnética.
2. Emisión de radiación electromagnética.
3. Una reacción química.
4. Ondas de radio.
5. Ondas de sonido.

Respuesta correcta: 3. Una reacción química.